Clinical trial exclusion criterion:
Patients with an active or suspected latent infection in or about the knee joint

Entity relations:
- Has_qualifier("infection", "knee joint")